Mitral regurgitation moderate or greater

The above is a clinical trial exclusion criterion. Annotated with entity spans:
[Condition: Mitral regurgitation] [Qualifier: moderate or greater]